Clinical trial inclusion criterion:
Subject has anatomical structures or physiological performance that would interfere with implant utilization.

Annotated entities:
- Observation: "anatomical structures"
- Observation: "physiological performance"
- Observation: "interfere with utilization"
- Device: "implant"